cirrhosis of the liver

The above is a clinical trial exclusion criterion. Annotated with entity spans:
[Condition: cirrhosis of the liver]